Clinical trial exclusion criterion:
6. Pregnant or lactating

Entity relations:
- OR("Pregnant", "lactating")